二尖瓣脫垂症候群患者之聽診，常見有收縮期拍答聲（click）及雜音，該拍答聲及雜音可因下列何 項步驟，延遲產生甚而消失：
A. 站立
B. valsalva maneuver
C. 吸入 amy1 nitrate
D. 蹲踞（ 	squatting）

正確答案：D. 蹲踞（ 	squatting）